有關成體腦區與胚胎時期腦泡（brain vesicle）發育起源之關聯，何者錯誤？
A. 橋腦（pons）－後腦（rhombencephalon）
B. 小腦（cerebellum）－前腦（prosencephalon）
C. 視丘（thalamus）－前腦（prosencephalon）
D. 頂蓋（tectum）－中腦（mesencephalon）

正確答案：B. 小腦（cerebellum）－前腦（prosencephalon）